Clinical trial inclusion criterion:
Healthy volunteer without significant medical problems

Entity relations:
- Has_qualifier("volunteer", "Healthy")